Clinical trial inclusion criterion:
The patient is willing and able to complete protocol required baseline assessments and procedures

Entity relations:
- AND("willing and able to complete protocol", "baseline assessments")
- AND("willing and able to complete protocol", "baseline procedures")